Una mujer de 32 años solicita consejo preconcepcional. La paciente le refiere que fue sometida a una conización cervical por una lesión intraepitelial de alto grado (H-SIL) y que posteriormente sufrió tres abortos entre las 20 y 22 semanas de gestación. No tiene hijos vivos. En las tres ocasiones acudió a Urgencias con sensación de peso en hipogastrio y allí se constató que llegaba con una dilatación de 8 cm y con las membranas amnióticas prominentes. Nunca había sentido contracciones. ¿Qué consejo le daría para el próximo embarazo?
1. Le pautaría una profilaxis con atosibán por vía oral durante todo el embarazo.
2. Le ofrecería la maduración pulmonar con corticoides a partir de las 19-20 semanas de gestación.
3. Le recomendaría realizar un cerclaje cervical programado a partir de la semana 14 de gestación.
4. Le aconsejaría no intentar más embarazos por el alto riesgo de recidiva.
5. Le recomendaría recurrir a las técnicas de reproducción asistida.

Respuesta correcta: 3. Le recomendaría realizar un cerclaje cervical programado a partir de la semana 14 de gestación.